2. insertional AT

The above is a clinical trial exclusion criterion. Annotated with entity spans:
2. [Condition: insertional AT]